El dye-test (prueba de Sanbin-Feldman) es el método de referencia para el diagnóstico de:
1. Criptosporidiosis.
2. Sarcocistosis.
3. Malaria.
4. Toxoplasmosis.
5. Ciclosporosis.

Respuesta correcta: 4. Toxoplasmosis.